TCR為T細胞辨識外來抗原之主要分子，但TCR本身並不足以執行訊息傳遞的功能。TCR必須與CD3 complex 組合為TCR complex以達到專一辨識抗原及訊息傳遞作用。下列原因何者錯誤？
A. TCR的α-chain及β-chain的cytoplasmic domain非常短，無法進行signal transduction
B. TCR與CD3 complex結合而表現在細胞表面
C. CD3 complex的膜蛋白分子具有immunoreceptor tyrosine-based activation motifs（ITAMs），故能促進胞內訊
D. CD3 complex的膜蛋白分子具有immunoreceptor tyrosine-based inhibition motifs（ITIMs），故能促進胞內訊息

正確答案：D. CD3 complex的膜蛋白分子具有immunoreceptor tyrosine-based inhibition motifs（ITIMs），故能促進胞內訊息